What is Luteolin?

Luteolin, a polyphenolic flavonoid, has potent anti-inflammatory properties.